Clinical trial exclusion criterion:
Presenting an acute endodontic/periodontal lesion in the neighboring areas to the implant site.

Annotated entities:
- Condition: "periodontal lesion"
- Condition: "lesion endodontic"